有關肛門瘻管的敘述，下列何者錯誤？
A. 肛門瘻管多由肛門腺體發炎所致
B. 瘻管依瘻管解剖走向之不同分為四種型態，而其中以 trans-sphincteric type 最常見
C. Goodsall's rule 是指瘻管外口位於後半面肛周皮膚時，其內口常位於正後方肛門內
D. 瘻管手術治療時，內括約肌（internal sphincter）多半會被切斷

正確答案：B. 瘻管依瘻管解剖走向之不同分為四種型態，而其中以 trans-sphincteric type 最常見